Clinical trial exclusion criterion:
Subjects receiving chronic or prophylactic antibiotic therapy.

Annotated entities:
- Procedure: "prophylactic antibiotic therapy"
- Procedure: "chronic antibiotic therapy"